Which class of genes are mutated in Diamond Blackfan Anemia patients?

three genes encoding ribosomal proteins have been associated to dba: after rps19, mutations in genes rps24 and rps17 were recently identified in a fraction of the patients.